5. pre-existing neuropathy and medical conditions or deformities which would compromise block or anesthetic safety

The above is a clinical trial exclusion criterion. Annotated with entity spans:
5. [Temporal: pre-existing] [Condition: neuropathy] and [Undefined_semantics: medical conditions or deformities which would compromise block or anesthetic safety]